Unstable or uncooperative patients

The above is a clinical trial exclusion criterion. Annotated with entity spans:
[Condition: Unstable] or [Condition: uncooperative patients]